Clinical trial exclusion criterion:
Chronic kidney disease in stages = 4, as defined per National Kidney Foundation (8).

Entity relations:
- Has_value("stages", "= 4")
- AND("Chronic kidney disease", "stages")
- Has_qualifier("stages", "National Kidney Foundation")